What is the definition of General Regulatory Factors (GRFs)?

GRFs, which bind to sites scattered throughout the genome within promoters, would not only play a key role in regulating gene expression but also partition the genome in functionally independent domains.